What are DMARDs?

Treatment with disease-modifying antirheumatic drugs (DMARDs) was 61% (claims data)